Current or chronic history of liver disease, or known hepatic or biliary abnormalities (with the exception of Gilbert's syndrome or asymptomatic gallstones).

The above is a clinical trial exclusion criterion. Annotated with entity spans:
[Temporal: Current] or [Temporal: chronic] [Temporal: history] of [Condition: liver disease], or known [Condition: hepatic] or [Condition: biliary abnormalities] (with the [Negation: exception] of [Condition: Gilbert's syndrome] or [Qualifier: asymptomatic] [Condition: gallstones]).